El relajante muscular suxetonio (succinilcolina), que se diseñó a partir del decametonio por sustitución de dos grupos etileno por dos funciones éster, susceptibles de un metabolismo hidrolítico, es un:
1. Profármaco.
2. Fármaco duro.
3. Fármaco apolar.
4. Fármaco quiral.
5. Fármaco blando.

Respuesta correcta: 5. Fármaco blando.